Clinical trial exclusion criterion:
7. History of alcohol abuse or use of any illicit drugs

Annotated entities:
- Parsing_Error: "7."
- Condition: "alcohol abuse"
- Condition: "use of illicit drugs"